Clinical trial exclusion criterion:
Non-English speaking subjects

Annotated entities:
- Non-query-able: "Non-English speaking subjects"